La causa mas frecuente de quilotórax es:
1. Tumores del mediastino.
2. Traumatismo.
3. Hipertrigliceridemia.
4. Linfoma.

Respuesta correcta: 2. Traumatismo.